La insulina disminuye la expresión del gen de:
1. Fosfofructoquinasa-1.
2. Piruvato quinasa.
3. Piruvato deshidrogenasa.
4. Fosfoenolpiruvato carboxiquinasa.
5. Acetil-CoA carboxilasa.

Respuesta correcta: 4. Fosfoenolpiruvato carboxiquinasa.